Incarcerated individuals

The above is a clinical trial exclusion criterion. Annotated with entity spans:
[Person: Incarcerated individuals]